What is the role of ZCCHC17?

ZCCHC17 is a master regulator of synaptic gene expression in Alzheimer's disease. Master regulator analysis identifies ZCCHC17 as normally supporting the expression of a network of synaptic genes, and predicts that ZCCHC17 dysfunction in AD leads to lower expression of these genes. ZCCHC17 is normally expressed in neurons and is reduced early in the course of AD pathology. Its loss in rat neurons leads to lower expression of the majority of the predicted synaptic targets.